Clinical trial exclusion criterion:
Use of tobacco products other than cigarettes in past 30 days

Entity relations:
- Has_context("other than", "cigarettes")
- Has_temporal("Use of tobacco", "past 30 days")